下列何者不是導致流感病毒產生抗原飄移（antigenic drift）之原因？
A. 當兩種病毒發生基因重分配（genetic reassortment）所致
B. 因為病毒合成 RNA 常發生錯誤、引起突變所致
C. 常發生於血球凝集素基因（hemagglutinin gene）
D. 常發生於神經胺酸酶基因（neuraminidase gene）

正確答案：A. 當兩種病毒發生基因重分配（genetic reassortment）所致